BMI less than 18.5

The above is a clinical trial exclusion criterion. Annotated with entity spans:
[Measurement: BMI] [Value: less than 18.5]